What antibiotic is currently used as the standard of care for Clostridium Difficile infection as of 2018

Clostridium difficile continues to be one of the most prevalent hospital-acquired bacterial infections in the developed world, despite the recent introduction of a novel and effective antibiotic agent  fidaxomicin